Patient is willing and able to give informed consent; and

The above is a clinical trial inclusion criterion. Annotated with entity spans:
[Informed_consent: Patient is willing and able to give informed consent]; and